下列有關老人常見之焦慮疾患之陳述，何者為非？
A. 老人罕見年老才罹患恐慌症
B. 老人最常見之焦慮疾患是廣泛性焦慮症
C. 老人恐懼症之症狀較年輕人輕
D. 老人罹患強迫症者，常在其年輕時就呈現要求整齊、完美、守時及節儉

正確答案：B. 老人最常見之焦慮疾患是廣泛性焦慮症